64歲男性有糖尿病和高血壓病史，五天來有發燒、寒顫、右上腹痛，無解尿困難或疼痛情形；腹部超音波發現右肝有4.5公分的異質性病灶，肝內膽道無擴大情形。需氧和厭氧血液培養瓶皆長出革蘭氏陰性桿菌。依此病況，最可能之病原菌為何？
A. Pseudomonas aeruginosa
B. Bacteroides fragilis
C. Enterobacter cloacae
D. Klebsiella pneuomoniae

正確答案：D. Klebsiella pneuomoniae